Patients diagnosed with primary biliary cholangitis

The above is a clinical trial inclusion criterion. Annotated with entity spans:
Patients diagnosed with [Condition: primary biliary cholangitis]